假性痛風（pseudogout）關節炎之二羥焦磷酸鈣（calcium pyrophosphate dehydrate）結晶最常堆積在下列那一關節？
A. 腕關節
B. 肩關節
C. 肘關節
D. 膝關節

正確答案：D. 膝關節